Clinical trial exclusion criterion:
Patients receiving benzodiazepines and narcotics.

Entity relations:
- OR("benzodiazepines", "narcotics")